Clinical trial exclusion criterion:
acute myocardial infarction, heart failure, neoplastic disease, chronic diseases that may affect the inflammatory profile both systemic and epicardial (cancer, chronic intestinal inflammation, hepatitis, AIDS); life expectancy < 6 months, previous CABG and/or other open heart surgery intervention, acute coronary syndrome

Entity relations:
- Has_qualifier("chronic diseases", "may affect the inflammatory profile")
- Has_qualifier("chronic diseases", "systemic")
- Subsumes("chronic diseases", "cancer")
- Has_value("life expectancy", "< 6 months")
- Has_temporal("CABG", "previous")
- Has_qualifier("open heart surgery intervention", "other")
- OR("systemic", "epicardial")
- OR("cancer", "hepatitis", "chronic intestinal inflammation", "AIDS")
- OR("acute myocardial infarction", "open heart surgery intervention", "acute coronary syndrome", "life expectancy", "chronic diseases", "neoplastic disease", "heart failure", "CABG")